Patients with history of bleeding disorders or on anticoagulant therapy.

The above is a clinical trial exclusion criterion. Annotated with entity spans:
Patients with [Temporal: history] of [Condition: bleeding disorders] or on [Procedure: anticoagulant therapy].